Pregnancy or breastfeeding, or trying to conceive

The above is a clinical trial inclusion criterion. Annotated with entity spans:
[Condition: Pregnancy] or [Observation: breastfeeding], or [Condition: trying to conceive]